Clinical trial exclusion criterion:
marked brain atrophy as detected by magnetic resonance imaging

Annotated entities:
- Condition: "brain atrophy"
- Procedure: "magnetic resonance imaging"